Intracranial infection.

The above is a clinical trial exclusion criterion. Annotated with entity spans:
[Condition: Intracranial infection].